對於急性心肌梗塞的患者，考慮給予血栓溶解藥物（fibrinolytic agents，如tPA）時，下列那一項不是絕對禁忌症？
A. 年齡超過75歲
B. 曾有過腦出血病史
C. 血壓超過180/110毫米汞柱
D. 最近3個月曾有梗塞性腦中風病史

正確答案：A. 年齡超過75歲